下列何者最不可能是 cervical spondylosis with myelopathy 的臨床表現？
A. 頸部僵硬疼痛
B. 上肢疼痛
C. 下肢僵硬無力（spastic weakness）
D. 下肢肌肉萎縮（muscle atrophy）

正確答案：D. 下肢肌肉萎縮（muscle atrophy）